Clinical trial exclusion criterion:
Congestive heart failure

Annotated entities:
- Condition: "Congestive heart failure"